Clinical trial exclusion criterion:
unstable medical condition like heart disease, uncontrolled hypertension, thyroid disease, diabetes, renal or liver impairment, or glaucoma

Entity relations:
- Has_qualifier("medical condition", "unstable")
- Has_qualifier("hypertension", "uncontrolled")
- Subsumes("medical condition", "heart disease")
- OR("heart disease", "hypertension", "thyroid disease", "diabetes", "renal impairment", "liver impairment", "glaucoma")